Clinical trial exclusion criterion:
Known allergic reaction to tranexamic acid

Annotated entities:
- Condition: "allergic"
- Drug: "tranexamic acid"